Clinical trial inclusion criterion:
ASA 1-2

Annotated entities:
- Measurement: "ASA"
- Value: "1-2"